Cite tres aminoácidos que estén cargados positivamente a pH neutro:
1. Lisina, Arginina e Histidina.
2. Lisina, Histidina y Triptófano.
3. Arginina, Glicina y Prolina.
4. Arginina, Lisina y Prolina.

Respuesta correcta: 1. Lisina, Arginina e Histidina.